Active psychiatric disease (psychotic illness, major depression, or acute anxiety attacks) which prevents subject compliance with the requirements of the investigational study testing

The above is a clinical trial exclusion criterion. Annotated with entity spans:
Active [Condition: psychiatric disease] ([Condition: psychotic illness], [Condition: major depression], or [Condition: acute anxiety attacks]) which prevents subject compliance with the requirements of the investigational study testing